Clinical trial exclusion criterion:
Allergy, sensitivity, or absolute contraindications to any of the medications involved in the study

Entity relations:
- Has_qualifier("medications", "study")
- AND("Allergy", "medications")
- OR("Allergy", "sensitivity", "contraindications")